Clinical trial exclusion criterion:
History of interstitial lung disease (ILD) e.g., interstitial pneumonitis, pulmonary fibrosis or evidence of ILD on baseline chest computer tomography.

Annotated entities:
- Condition: "interstitial lung disease"
- Condition: "ILD"
- Condition: "interstitial pneumonitis"
- Condition: "pulmonary fibrosis"
- Mood: "evidence of"
- Condition: "ILD"
- Temporal: "baseline"
- Procedure: "chest computer tomography"